Clinical trial inclusion criterion:
Primary periampullary tumor

Entity relations:
- Has_qualifier("periampullary tumor", "Primary")